4. Enrolled within 18 hours of commencing antimalarial treatment

The above is a clinical trial inclusion criterion. Annotated with entity spans:
[Parsing_Error: 4.] [Observation: Enrolled] [Temporal: within 18 hours] of [Reference_point: commencing antimalarial treatment]